Clinical trial exclusion criterion:
Likely to not follow the protocol

Annotated entities:
- Post-eligibility: "Likely to not follow the protocol"